Clinical trial inclusion criterion:
Blasts < 1,000/µL in peripheral blood (PB) on day 8

Entity relations:
- Subsumes("peripheral blood", "PB")
- Has_qualifier("Blasts", "peripheral blood")
- Has_temporal("Blasts", "on day 8")